What is the mechanism of action of Tezepelumab?

Tezepelumab is human monoclonal antibody specific for the epithelial-cell-derived cytokine thymic stromal lymphopoietin (TSLP).